Treatment with Urinary alkalinizers (e.g., sodium lactate, potassium citrate)

The above is a clinical trial exclusion criterion. Annotated with entity spans:
[Procedure: Treatment] with [Drug: Urinary alkalinizers] (e.g., [Drug: sodium lactate], [Drug: potassium citrate])